Clinical trial exclusion criterion:
HIV/ AIDS

Annotated entities:
- Condition: "HIV"
- Condition: "AIDS"